一位 4 歲女童在 3 週前相當健康，最近 3 週每天傍晚發高燒超過 39.5°C，兩次高燒間體溫會恢復正常，活力不受影響；但高燒時女童會有倦怠感，情緒不穩，早晨關節有僵直感，軀幹出現淡紅色皮疹且手部關節和膝關節有腫脹的現象，最有可能診斷是下列何種疾病？
A. 幼年型類風濕性關節炎（juvenile idiopathic arthritis）
B. 風濕熱（rheumatic fever）
C. 登革熱（dengue fever）
D. 全身性紅斑性狼瘡（systemic lupus erythematosus）

正確答案：A. 幼年型類風濕性關節炎（juvenile idiopathic arthritis）